Clinical trial exclusion criterion:
Chronic use of opioid and sedatives

Annotated entities:
- Drug: "opioid"
- Drug: "sedatives"
- Multiplier: "Chronic use"